Clinical trial inclusion criterion:
sign the informed consent form

Annotated entities:
- Informed_consent: "sign the informed consent form"